La segunda ramificación del cayado (arco) aórtico es:
1. La arteria carótida común izquierda.
2. La arteria subclavia izquierda.
3. El tronco braquiocefálico.
4. El tronco celíaco.

Respuesta correcta: 1. La arteria carótida común izquierda.